Clinical trial inclusion criterion:
Known allergy to tested drugs

Entity relations:
- AND("allergy", "tested drugs")